Clinical trial exclusion criterion:
Individuals taking over the counter memory enhancing or protecting medications (e.g. ginkgo biloba, vitamins) are not excluded.

Annotated entities:
- Drug: "over the counter memory enhancing medications"
- Drug: "over the counter memory protecting medications"
- Drug: "ginkgo biloba"
- Drug: "vitamins"
- Non-representable: "Individuals taking over the counter memory enhancing or protecting medications (e.g. ginkgo biloba, vitamins) are not excluded."